Clinical trial inclusion criterion:
Treated by a single NA (lamivudine, adefovir, entecavir or tenofovir) for 6 months to 5 years

Entity relations:
- Has_multiplier("NA", "single")
- AND("Treated", "NA")
- Subsumes("NA", "lamivudine")
- Has_temporal("Treated", "for 6 months to 5 years")
- OR("lamivudine", "entecavir", "adefovir", "tenofovir")